Clinical trial exclusion criterion:
Milk Protein Allergy: History of severe milk protein allergy.

Annotated entities:
- Condition: "Milk Protein Allergy"
- Condition: "milk protein allergy"
- Qualifier: "severe"